婦女停經後，體內雌激素由何處產生？
A. 骨骼
B. 脂肪
C. 神經
D. 血管

正確答案：B. 脂肪